Anaemia, defined as Hb <9g/dl

The above is a clinical trial exclusion criterion. Annotated with entity spans:
[Condition: Anaemia], defined as [Measurement: Hb] [Value: <9g/dl]